Clinical trial exclusion criterion:
active bowel inflammation

Entity relations:
- Has_temporal("bowel inflammation", "active")